Clinical trial inclusion criterion:
Progression on or failure to respond to at least one previous chemotherapy regimen for metastatic disease

Entity relations:
- AND("chemotherapy regimen", "metastatic disease")
- Has_temporal("chemotherapy regimen", "previous")
- AND("Progression on", "chemotherapy regimen")
- OR("Progression on", "failure to respond")